51 歲陳小姐，近一個月發現右側頭皮有局部脫髮，頭皮搔癢、脫皮並且產生疼痛之區塊，之前醫院醫師給予之抗生素及抗發炎之 prednisone 並沒有改善狀況。於是醫師詳細問診後才知道：陳小姐 3 個月前撿到一隻很可愛的流浪犬，取名波比。波比很活潑討喜，經常與陳小姐親近，醫師於是以伍氏燈（Wood's light）檢查呈陽性，進一步取患部皮屑培養；結果養出白色毛狀菌落，顯微鏡觀察呈現分隔菌絲（septate hyphae），產生數量眾多之梭形、厚壁、表面粗糙之大孢子（macrospores）。 最可能之感染病原是下列何者？
A. Epidermophyton floccosum
B. Microsporum canis
C. Microsporum gypseum
D. Trichophyton schoenleinii

正確答案：B. Microsporum canis